Describe Achenbach’s syndrome.

Achenbach’s syndrome is Paroxysmal finger haematoma. It is benign condition resulting in the sudden appearance of bruising on one or more fingers, either spontaneously or after minimal trauma, and resolving without treatment.It can be differentiated from other pathologies by clinical spectrum, patient demographics and in doubtful circumstances (acute limb ischemia) by Doppler sonography.